1. Justification: The use of certain medications or drugs can lower seizure threshold and is therefore contra-indicated for TMS.

The above is a clinical trial exclusion criterion. Annotated with entity spans:
[Parsing_Error: 1.] [Non-representable: Justification: The use of certain medications or drugs can lower seizure threshold and is therefore contra-indicated for TMS.]